Meet DSM-IV criteria for BPD as assessed by the Structured Clinical Interview for DSM-IV Personality Disorders (SCID-II).

The above is a clinical trial inclusion criterion. Annotated with entity spans:
[Qualifier: Meet DSM-IV criteria] for [Condition: BPD] as assessed by the [Procedure: Structured Clinical Interview for DSM-IV Personality Disorders (SCID-II)].